What is the link between psoriatic arthritis and depression

Depression Is Associated with an Increased Risk of Psoriatic Arthritis among Patients with Psoriasis.